Estimated glomerular filtration rate (eGFR) <30%.

The above is a clinical trial exclusion criterion. Annotated with entity spans:
[Measurement: Estimated glomerular filtration rate (eGFR)] [Value: <30%].